Al entrenar a un paciente para que realice correctamente ejercicios de respiración diafragmática le indicaremos que:
1. Inhale por la nariz mientras cuenta hasta 3 y espire rápidamente con los labios fruncidos.
2. Inhale por la boca y contraiga los músculos abdominales durante otros 7 segundos.
3. Presione firmemente el abdomen hacia fuera y hacia abajo al espirar.
4. Inhale lenta y profundamente por la nariz y empuje el abdomen hacia afuera.
5. Se ayude apoyando las manos sobre la caja torácica mientras inspira.

Respuesta correcta: 4. Inhale lenta y profundamente por la nariz y empuje el abdomen hacia afuera.